Prior therapy with SYK inhibitors.

The above is a clinical trial exclusion criterion. Annotated with entity spans:
[Temporal: Prior] [Procedure: therapy] with [Drug: SYK inhibitors].